En la medición y valoración del estrés que presenta un individuo:
1. Pueden utilizarse medidas fisiológicas y bioquímicas que resultan más fiables que los autoinformes que realiza el propio individuo.
2. Pueden utilizarse autoinformes que resultan más fiables que las medidas fisiológicas y bioquímicas.
3. Los autoinformes y las medidas fisiológicas son igualmente fiables para determinar el grado de estrés de un individuo y predecir la probabilidad de aparición de enfermedades derivadas del mismo.
4. Los autoinformes son más fiables para determinar el grado de estrés de un individuo y las medidas fisiológicas y bioquímicas para predecir la probabilidad de aparición de enfermedades derivadas del mismo.

Respuesta correcta: 1. Pueden utilizarse medidas fisiológicas y bioquímicas que resultan más fiables que los autoinformes que realiza el propio individuo.